Clinical trial inclusion criterion:
Male or female = 18 years of age at Visit 1.

Entity relations:
- Has_index("at Visit 1.", "Visit 1")
- Has_value("age", "= 18 years")
- Has_temporal("age", "at Visit 1.")
- OR("Male", "female")